Porphyria reported by patient

The above is a clinical trial exclusion criterion. Annotated with entity spans:
[Condition: Porphyria] reported by patient